Clinical trial inclusion criterion:
6. For females of reproductive potential, use of at least one barrier contraceptive and a second effective birth control method during the study and for at least two weeks after the last dose. For male subjects, use of appropriate contraception (e.g., condoms), so their female partners of reproductive potential do not become pregnant during the study and for at least two weeks after the last dose

Entity relations:
- Has_multiplier("barrier contraceptive", "at least one")
- Has_qualifier("birth control method", "second")
- Has_qualifier("birth control method", "effective")
- Has_index("for at least two weeks after the last dose", "the last dose")
- Has_temporal("birth control method", "during the study")
- Has_temporal("birth control method", "for at least two weeks after the last dose")
- AND("reproductive potential", "barrier contraceptive")
- Subsumes("contraception", "condoms")
- Has_qualifier("contraception", "appropriate")
- Has_negation("pregnant", "not become")
- Has_index("for at least two weeks after the last dose", "the last dose")
- Has_temporal("pregnant", "during the study")
- Has_temporal("pregnant", "for at least two weeks after the last dose")
- AND("female", "reproductive potential")
- AND("female", "pregnant")
- AND("reproductive potential", "females")